clinical suspicion that subject can not use PCA adequately

The above is a clinical trial exclusion criterion. Annotated with entity spans:
[Mood: clinical suspicion] that [Observation: subject can not use PCA adequately]